有關腎臟移植，下列那一組預後最不理想？
A. 器捐者（donor）：血型 B 型，受贈者（recipient）：血型 AB 型
B. 器捐者：B 型肝炎，受贈者：B 型肝炎
C. 器捐者：血型 O 型，受贈者：血型 B 型
D. 器捐者：B 型肝炎，受贈者：C 型肝炎

正確答案：D. 器捐者：B 型肝炎，受贈者：C 型肝炎